La amnesia retrógrada se define como:
1. Pérdida de memoria que abarca el período previo a la aparición del trastorno que dio lugar a la amnesia.
2. Pérdida de memoria que abarca el período consecutivo a la aparición del trastorno que dio lugar a la amnesia.
3. Pérdida parcial de memoria que abarca un período concreto.
4. Pérdida de memoria en ausencia de un trastorno orgánico cerebral.
5. Distorsiones o errores de la memoria.

Respuesta correcta: 1. Pérdida de memoria que abarca el período previo a la aparición del trastorno que dio lugar a la amnesia.